Cuando se desacopla la fosforilación oxidativa, cuál de las acciones siguientes tiene lugar:
1. Se acelera la fosforilación del ADP.
2. Continúa la fosforilación del ADP, pero se detiene la captura de oxígeno.
3. Se detiene la fosforilación del ADP, pero continúa la captura de oxígeno.
4. Se detienen tanto la fosforilación del ADP como la captura del oxígeno.

Respuesta correcta: 3. Se detiene la fosforilación del ADP, pero continúa la captura de oxígeno.